Clinical trial exclusion criterion:
Chronic administration (defined as more than 14 days) of immunosuppressants or other immune-modifying drugs within six months prior to the first administration of the study vaccine.

Annotated entities:
- Temporal: "more than 14 days"
- Qualifier: "Chronic"
- Drug: "immunosuppressants"
- Drug: "other immune-modifying drugs"
- Temporal: "within six months prior"